El hidróxido de calcio:
1. Se prepara añadiendo agua al óxido de calcio.
2. Es un compuesto de color rojo intenso.
3. Cristaliza al calentar.
4. En disolución permanece inalterado al aire durante meses.
5. Se utiliza para pintar después de neutralizar con HCl.

Respuesta correcta: 1. Se prepara añadiendo agua al óxido de calcio.